El producto de reacción de la ciclohexanona con bromo catalizado por una base es:
1. 2-Bromociclohexanona.
2. 2,2-Dibromociclohexanona.
3. 2,2,6-Tribomociclohexanona.
4. 1,1-Dibromociclohexano.
5. 2,2,6,6-Tetrabromociclohexanona.

Respuesta correcta: 5. 2,2,6,6-Tetrabromociclohexanona.